Capable of providing written informed consent

The above is a clinical trial inclusion criterion. Annotated with entity spans:
[Observation: Capable of providing written informed consent]